Metastatic ovarian cancer (OV)

The above is a clinical trial inclusion criterion. Annotated with entity spans:
[Condition: Metastatic ovarian cancer] (OV)